下列何種藥物造成的肝傷害以肝細胞壞死為主？
A. amiodarone
B. acetaminophen
C. phenothiazine
D. methotrexate

正確答案：B. acetaminophen